atrial fibrillation/flutter with a mean ventricular response rate at rest >100 beats per minute

The above is a clinical trial exclusion criterion. Annotated with entity spans:
[Condition: atrial fibrillation]/flutter with a [Measurement: mean ventricular response rate] [Qualifier: at rest] [Value: >100 beats per minute]